Clinical trial inclusion criterion:
Subjects that are age 18-90

Entity relations:
- Has_value("age", "18-90")